Clinical trial exclusion criterion:
Administration of doxycycline, azithromycin, chloramphenicol, rifampicin, or tetracycline during the preceding 7 days

Annotated entities:
- Drug: "doxycycline"
- Drug: "azithromycin"
- Drug: "chloramphenicol"
- Drug: "rifampicin"
- Drug: "tetracycline"
- Temporal: "during the preceding 7 days"